Clinical trial exclusion criterion:
Treatment with immunosuppressants (e.g. cyclosporine and tacrolimus)

Annotated entities:
- Drug: "immunosuppressants"
- Drug: "cyclosporine"
- Drug: "tacrolimus"